Clinical trial exclusion criterion:
Pregnant (or anticipate pregnancy during the study period) or lactating women

Entity relations:
- Has_mood("pregnancy", "anticipate during the study period")
- Subsumes("Pregnant", "pregnancy")
- OR("Pregnant", "lactating")